Histological diagnosis confirmed by two endoscopies with biopsies and two pathological readings; biopsies should be carried out according to the protocol of the SFED (four-quadrant biopsies every cm) with at least once acetic acid for staining. Operators describe Barrett's esophagus using he SFED planimetric model. The final exam will be no more than two months before the date of treatment and should have been achieved in investigator establishment,

The above is a clinical trial inclusion criterion. Annotated with entity spans:
[Qualifier: Histological] [Condition: diagnosis] confirmed by [Multiplier: two] [Procedure: endoscopies] with [Procedure: biopsies] and [Multiplier: two] [Procedure: pathological readings]; [Non-representable: biopsies should be carried out according to the protocol of the SFED (four-quadrant biopsies every cm) with at least once acetic acid for staining.] [Non-representable: Operators describe Barrett's esophagus using he SFED planimetric model.] [Non-representable: The final exam will be no more than two months before the date of treatment and should have been achieved in investigator establishment,]